¿Qué tinción se utiliza para el diagnóstico de laboratorio de las enfermedades debidas a Mycobacterium spp?
1. Gram.
2. Ziehl-Neelsen.
3. Leifson.
4. Wirtz-Conklin.

Respuesta correcta: 2. Ziehl-Neelsen.